以下何者不位於腸腺（crypts of Lieberkühn）？
A. 再生幹細胞（regenerative stem cells）
B. 杯狀細胞（goblet cells）
C. 壁細胞（parietal cells）
D. 潘氏細胞（Paneth cells）

正確答案：C. 壁細胞（parietal cells）